我國的全民健保規劃為一種社會保險，以下何者符合「社會保險」的原則？
A. 不准帶病投保
B. 可以自由參加
C. 收入較高者繳交較多保費
D. 健康較差者繳交較多保費

正確答案：C. 收入較高者繳交較多保費